Clinical trial exclusion criterion:
Evidence of drug and/or alcohol abuse (20g/day for women & 30g/day for men).

Entity relations:
- AND("20g/day", "women")
- AND("30g/day", "men")
- Subsumes("alcohol abuse", "20g/day")
- OR("drug abuse", "alcohol abuse")
- OR("20g/day", "30g/day")